Clinical trial exclusion criterion:
History of tobacco or tobacco product use unless abstinent for at least one year prior to the Screening Visit. This criterion does not apply to heterozygous subjects.

Annotated entities:
- Temporal: "History"
- Condition: "tobacco use"
- Condition: "tobacco product use"
- Condition: "abstinent"
- Temporal: "for at least one year prior to the Screening Visit"
- Reference_point: "the Screening Visit"
- Negation: "unless"
- Parsing_Error: "This criterion does not apply to heterozygous subjects."